Clinical trial inclusion criterion:
Normal renal and hepatic laboratory profiles

Entity relations:
- Has_value("renal laboratory profile", "Normal")
- Has_value("hepatic laboratory profile", "Normal")